pregnant women in first trimester

The above is a clinical trial exclusion criterion. Annotated with entity spans:
[Condition: pregnant] [Person: women] in [Condition: first trimester]